Frank psychosis

The above is a clinical trial exclusion criterion. Annotated with entity spans:
[Qualifier: Frank] [Condition: psychosis]